腦動靜脈血管異常（arteriovenous malformation）的臨床表現，下列何者較少？
A. 顱內出血（intracranial hemorrhage）
B. 癲癇（seizure）
C. 頭痛（headache）
D. 步態不穩（unstable gait）

正確答案：D. 步態不穩（unstable gait）